Clinical trial exclusion criterion:
taking antibiotics or PPIs or bismuth salts within four weeks

Entity relations:
- Has_temporal("antibiotics", "within four weeks")
- OR("antibiotics", "PPIs", "bismuth salts")